Clinical trial exclusion criterion:
Patients using medication that could potentiate the effect of botulinum (ex: aminoglycoside antibiotics)

Annotated entities:
- Drug: "botulinum"
- Condition: "potentiate the effect"
- Drug: "medication"
- Drug: "aminoglycoside antibiotics"